Clinical trial inclusion criterion:
At least 4 weeks since last surgery or radiation therapy.

Entity relations:
- Has_index("At least 4 weeks since last surgery or radiation therapy", "last surgery")
- Has_index("At least 4 weeks since last surgery or radiation therapy", "radiation therapy")
- OR("last surgery", "radiation therapy")